Clinical trial exclusion criterion:
With contraindication to receive adjuvant chemotherapy.

Annotated entities:
- Condition: "contraindication"
- Procedure: "adjuvant chemotherapy"
- Subjective_judgement: "contraindication"
- Undefined_semantics: "contraindication"